¿Cuál será el diagnóstico más probable de un individuo con un déficit de coproporfirinógeno oxidasa?:
1. Coproporfiria hereditaria.
2. Anemia ferropénica.
3. Anemia falciforme.
4. Talasemia intermedia.

Respuesta correcta: 1. Coproporfiria hereditaria.